Major abdominal surgery

The above is a clinical trial inclusion criterion. Annotated with entity spans:
[Procedure: Major abdominal surgery]